Clinical trial inclusion criterion:
diagnosis of stage II adhesive capsulitis as determined by clinical examination of the treating physician, and

Entity relations:
- Has_qualifier("adhesive capsulitis", "stage II")
- multi("as determined by clinical examination", "clinical examination")
- Has_qualifier("adhesive capsulitis", "as determined by clinical examination")